Clinical trial inclusion criterion:
CMV-positive GBM

Annotated entities:
- Qualifier: "CMV-positive"
- Condition: "GBM"
- Condition: "CMV"